Clinical trial inclusion criterion:
Subjects must have received no more than 2 prior systemic therapies for lymphoma. Prior therapy with systemic rituximab monotherapy or conventional chemotherapy (i.e. bendamustine, CVP (Cyclophosphamide, Vincristine Sulfate, Prednisone) or other) ± rituximab for indolent non-Hodgkin's lymphoma (NHL) ± maintenance/extended-use rituximab will count as 1 line of systemic therapy.

Annotated entities:
- Multiplier: "no more than 2"
- Temporal: "prior"
- Procedure: "systemic therapies for lymphoma"
- Drug: "rituximab"
- Procedure: "systemic monotherapy"
- Temporal: "Prior"
- Procedure: "conventional chemotherapy"
- Drug: "bendamustine"
- Drug: "CVP"
- Drug: "Cyclophosphamide"
- Drug: "Vincristine Sulfate"
- Drug: "Prednisone"
- Drug: "rituximab"
- Condition: "non-Hodgkin's lymphoma (NHL)"
- Qualifier: "indolent"
- Drug: "rituximab"
- Qualifier: "maintenance"
- Qualifier: "extended-use"